Clinical trial exclusion criterion:
Patients undergoing bilateral hip or knee replacement;

Annotated entities:
- Procedure: "knee replacement"
- Procedure: "hip replacement"
- Qualifier: "bilateral"